下列有關於藥物安全性試	之敘述，何者正確？
A. Subacute toxicity，通常使用2種動物，2種給藥途徑。主要是測試其no-effect dose以及 maximum tolerate dose
B. Acute toxicity，使用3種劑量，2種動物。主要是測試其生化以及生理作用
C. Mutagenic potential，主要測試藥物對細菌及哺乳類動物細胞之genetic stability
D. Carcinogenic potential 只需要使用1種動物

正確答案：C. Mutagenic potential，主要測試藥物對細菌及哺乳類動物細胞之genetic stability